Una prueba importante para distinguir Staphylococcus aureus de estafilococos saprófitos, como Staphylococcus epidermidis es:
1. Oxidasa.
2. Catalasa.
3. Indol.
4. Ureasa.
5. Coagulasa.

Respuesta correcta: 5. Coagulasa.